Clinical trial exclusion criterion:
Active bleeding or known bleeding disorder/diathesis

Annotated entities:
- Condition: "Active bleeding"
- Condition: "bleeding disorder"
- Condition: "diathesis"